Use of dipyridamole within the last 5 days

The above is a clinical trial exclusion criterion. Annotated with entity spans:
Use of [Drug: dipyridamole] [Temporal: within the last 5 days]